下列何種生理監測儀器無法測量 cardiac output 或 ejection fraction？
A. pulse-induced contour cardiac output（PiCCO）
B. transesophageal echocardiogram（TEE）
C. pulmonary artery catheter
D. ECG（electrocardiography）

正確答案：D. ECG（electrocardiography）